陳先生，現年 38 歲，身體健康，已婚，有一位 12 歲的男孩。二個月前，陳先生的 42 歲哥哥，被診斷有亨丁頓氏舞蹈症（Huntington's disease）。陳先生的父親因有嚴重神經疾病，已於五年前去世，推測是此症。陳先生自己要求進行基因檢測，不幸也證實他帶有此病症之基因。因此陳先生帶他兒子到醫院來，要求進行此病之基因檢測。現尚無治療此病之藥物，對於此要求應如何處理？
A. 同意進行，因為父母依法是子女的監護人，如果不幸帶此基因，以青少年能懂的言語解釋給陳先生的兒子知道
B. 同意進行，因為父母依法是子女的監護人，如果不幸帶此基因，則不予告知
C. 不同意進行，因為現在此症尚無有效之治療法，如果不幸帶此基因，男孩將一輩子生活在疾病陰影中
D. 不同意進行，因為男孩尚未成年，此類重大無法治療疾病之檢測，應待當事人成年後自行決定是否去作檢查

正確答案：D. 不同意進行，因為男孩尚未成年，此類重大無法治療疾病之檢測，應待當事人成年後自行決定是否去作檢查